Clinical trial exclusion criterion:
Subjects with a concurrent Axis II Cluster A Personality Disorder

Annotated entities:
- Condition: "Personality Disorder"
- Qualifier: "Axis II Cluster A"